Clinical trial inclusion criterion:
Having previously undergone BTI. The last injection must have been performed at least 4 months prior to inclusion.

Annotated entities:
- Procedure: "BTI"
- Procedure: "injection"
- Temporal: "at least 4 months prior to inclusion"
- Reference_point: "inclusion"